Clinical trial exclusion criterion:
Hypersensitivity to antiplatelet and/or anticoagulant drugs;

Entity relations:
- AND("Hypersensitivity", "antiplatelet drugs")
- OR("antiplatelet drugs", "anticoagulant drugs")